What is Leptomeningeal disease?

Neoplastic leptomeningeal disease (LMD) represents infiltration of the leptomeninges by tumor cells. LMD represents infiltration of the leptomeninges by tumor cells.